What is canSAR?

CanSAR (http://cansar.icr.ac.uk) is a public, freely available, integrative translational research and drug discovery knowledgebase. It integrates genomic, protein, pharmacological, drug and chemical data with structural biology, protein networks and unique, comprehensive and orthogonal 'druggability' assessment. canSAR is widely used worldwide by professors, biologists and scientists interested in the molecular biology of cancer, in particular with regard to translation-dependent and -independent pathways of cancer progression.